Clinical trial exclusion criterion:
Previous myocardial infarction (MI) or a percutaneous coronary intervention PCI within the past 3 months

Entity relations:
- Subsumes("myocardial infarction", "MI")
- Subsumes("percutaneous coronary intervention", "PCI")
- Subsumes("myocardial infarction", "within the past 3 months")
- OR("myocardial infarction", "percutaneous coronary intervention")